施行人工輔助生殖技術（ART）使用促性腺激素藥物刺激後，如何避免卵巢過度刺激症候群（OHSS）的發 生，下列何者正確？
A. 使用人類絨毛促性腺激素（hCG）取代以黃體生成激素（LH）刺激排卵
B. 使用促性腺激素釋放激素促進劑（agonist）療程時，以促性腺激素釋放激素拮抗劑（antagonist）刺激排卵
C. 追蹤測量發現雌激素值過高時，不考慮完全停止促性腺激素藥物刺激
D. 取卵後使用Cabergoline可能可以抑制血管內皮生⻑因子（VEGF）產生

正確答案：D. 取卵後使用Cabergoline可能可以抑制血管內皮生⻑因子（VEGF）產生